於腹腔鏡手術中，Pneumoperitoneum 的壓力最好不要超過多少 mmHg？
A. 9
B. 11
C. 13
D. 15

正確答案：D. 15